下列有關睪丸精細胞瘤（seminoma）的敘述，何者最正確？
A. 好發於嬰幼兒
B. 含有多量 placental alkaline phosphatase
C. 病患血清中α-fetoprotein 值常明顯上升
D. 對化療反應不佳，預後差

正確答案：B. 含有多量 placental alkaline phosphatase